Clinical trial inclusion criterion:
Perimenopausal women complaining of abnormal uterine bleeding (menorrhagia, metrorrhagia, polymenorrhoea or polymenorrhagia) without local gynecological cause.

Annotated entities:
- Person: "Perimenopausal"
- Person: "women"
- Condition: "abnormal uterine bleeding"
- Condition: "menorrhagia"
- Condition: "metrorrhagia"
- Condition: "polymenorrhoea"
- Condition: "polymenorrhagia"
- Negation: "without"
- Condition: "local gynecological cause"